臨床表現低血鈉、低血糖及色素沈著於皮膚皺摺（crease）處之患者，其原發病灶最可能位於何處？
A. 腎上腺
B. 腎臟
C. 腦下垂體
D. 肝臟

正確答案：A. 腎上腺